Clinical trial inclusion criteria:
Adolescent (10-21 years) undergoing spinal fusion for idiopathic scoliosis, spondylolisthesis or Scheuermann kyphosis.
Posterior spinal fusion
No contraindication for Pregabalin use
ASA I-III
Written informed consent

Annotated entities:
- Person: "Adolescent"
- Value: "10-21 years"
- Person: "years"
- Procedure: "spinal fusion"
- Condition: "idiopathic scoliosis"
- Condition: "spondylolisthesis"
- Condition: "Scheuermann kyphosis"
- Procedure: "Posterior spinal fusion"
- Condition: "contraindication"
- Negation: "No"
- Drug: "Pregabalin"
- Measurement: "ASA"
- Value: "I-III"
- Informed_consent: "Written informed consent"